Non-hematologic laboratory values as outlined in the protocol

The above is a clinical trial inclusion criterion. Annotated with entity spans:
[Context_Error: Non-hematologic laboratory values as outlined in the protocol]